What induces downstream of gene (DoG) readthrough transcription?

DoGs are induced by osmotic stress at the level of transcription by a mechanism that depends on calcium release from the endoplasmic reticulum mediated by IP3 receptors.